La unión de un activador alostérico a una enzima alostérica típicamente tiene como consecuencia:
1. Disminuir la Vmax.
2. La transición a un estado menos soluble.
3. Disminuir la Km por su sustrato.
4. La transición a una cinética hiperbólica.
5. La disociación de sus subunidades.

Respuesta correcta: 3. Disminuir la Km por su sustrato.